Clinical trial exclusion criterion:
Intracranial lesion associated with increased intracranial pressure

Annotated entities:
- Condition: "Intracranial lesion"
- Measurement: "intracranial pressure"
- Value: "increased"